粒線體氧化磷酸化的過程所產生的·O2- 自由基，可由下列那一個酵素去除？
A. NADH dehydrogenase
B. Glutathione peroxidase
C. Glutathione reductase
D. Superoxide dismutase

正確答案：D. Superoxide dismutase